Clinical trial exclusion criterion:
Allergy to ceftriaxone or macrolides

Annotated entities:
- Drug: "ceftriaxone"
- Drug: "macrolides"
- Condition: "Allergy"